Concurrent administration of any other anti-tumor therapy

The above is a clinical trial exclusion criterion. Annotated with entity spans:
[Temporal: Concurrent] administration of [Qualifier: any other] [Procedure: anti-tumor therapy]